Clinical trial inclusion criterion:
CrCl = 60 ml/min

Annotated entities:
- Measurement: "CrCl"
- Value: "= 60 ml/min"